Have history of female sterilization procedure

The above is a clinical trial exclusion criterion. Annotated with entity spans:
Have history of [Procedure: female sterilization procedure]